¿Cuál de los siguientes virus tiene su material genético segmentado en el virión?
1. Coronavirus.
2. Rhabdovirus.
3. Ortomixovirus.
4. Filovirus.

Respuesta correcta: 3. Ortomixovirus.